Clinical trial exclusion criterion:
Ocular surface scarring diseases

Annotated entities:
- Condition: "Ocular surface scarring diseases"